43歲女性最近經常身體不適就醫，主要症狀是心跳加快、冒	、手抖。她覺得好像無法呼吸、快要窒息的感覺，每次發作時間都很短，接受過很多檢查但得不到肯定的答案，心情有點害怕與沮喪。下列何者是最可能之診斷？
A. 廣泛性焦慮症（generalized anxiety disorder）
B. 換氣過度（hyperventilation）
C. 強迫性官能症（obsessive compulsive disorder）
D. 恐慌發作（panic attacks）

正確答案：D. 恐慌發作（panic attacks）